Clinical trial inclusion criterion:
Meet Diagnostic and Statistical Manual version IV (DSM-IV) criteria for alcohol dependence or & DSM-V criteria for alcohol use disorder, severe.

Annotated entities:
- Qualifier: "Diagnostic and Statistical Manual version IV (DSM-IV) criteria"
- Condition: "alcohol dependence"
- Qualifier: "DSM-V criteria"
- Condition: "alcohol use disorder"
- Qualifier: "severe"